Clinical trial inclusion criteria:
Age greater than or equal to 18 years
Have RA, as defined by the 1987 revised American College of Rheumatology criteria
In sustained clinical remission for the last 6 months while receiving treatment with either etanercept, infliximab, or adalimumab, and greater than or equal to 1 DMARD (methotrexate, hydroxychloroquine, sulfasalazine, leflunomide, minocycline, cyclosporine, azathioprine, gold, penicillamine). DAS28 should be less than 2.6 on each visit over the preceding 6 months, with at least one visit 2-4 months before enrollment. If there is no visit 6 months before enrollment, the nearest visit in the 6-12 month period before enrollment should be considered and have a DAS28 less than 2.6.

Annotated entities:
- Person: "Age"
- Value: "greater than or equal to 18 years"
- Condition: "RA"
- Qualifier: "1987 revised American College of Rheumatology criteria"
- Condition: "sustained clinical remission"
- Multiplier: "for the last 6 months"
- Drug: "etanercept"
- Drug: "infliximab"
- Drug: "adalimumab"
- Multiplier: "greater than or equal to 1"
- Drug: "DMARD"
- Drug: "methotrexate"
- Drug: "hydroxychloroquine"
- Drug: "sulfasalazine"
- Drug: "leflunomide"
- Drug: "minocycline"
- Drug: "cyclosporine"
- Drug: "azathioprine"
- Drug: "gold"
- Drug: "penicillamine"
- Measurement: "DAS28"
- Value: "less than 2.6"
- Multiplier: "over the preceding 6 months"
- Multiplier: "at least one"
- Procedure: "visit"
- Procedure: "visit"
- Multiplier: "on each visit"
- Temporal: "2-4 months before enrollment"
- Non-representable: "If there is no visit 6 months before enrollment, the nearest visit in the 6-12 month period before enrollment should be considered and have a DAS28 less than 2.6."